王小姐今年 25 歲，產科史為 G2P2，想要有第三個寶寶，但已經三年都沒有再懷孕了。她的月經規則，但她曾在兩年前因為闌尾炎闌尾破裂造成持續發燒，合併嚴重腹膜炎接受手術治療。她的先生 28 歲，精液分析（semen analysis）正常，她和先生都沒有內科方面的疾病。她因為不孕到你的門診求診，這對夫妻最有可能不孕的原因是：
A. 卵子品質（oocyte quality）不佳
B. 輸卵管因素（tubal factor）
C. 男性因素（male factor）
D. 子宮頸及免疫因素（cervical and immunologic factors）

正確答案：B. 輸卵管因素（tubal factor）